concomitant drug medication; The following drugs cause drug interaction with S-1.

The above is a clinical trial exclusion criterion. Annotated with entity spans:
[Temporal: concomitant] [Drug: drug] [Drug: medication]; [Non-representable: The following drugs cause drug interaction with S-1.]